Patients with Fasting Plasma Glucose <15mmol/L(270mg/dL) on screening

The above is a clinical trial inclusion criterion. Annotated with entity spans:
Patients with [Measurement: Fasting Plasma Glucose] [Value: <15mmol/L]([Value: 270mg/dL]) [Temporal: on screening]